Overweight and obese PCOS patients with newly diagnosed IGR;

The above is a clinical trial inclusion criterion. Annotated with entity spans:
[Condition: Overweight] and [Condition: obese] [Condition: PCOS] patients with [Temporal: newly diagnosed] [Condition: IGR];